Clinical trial exclusion criterion:
Underlying chronic illness other than asthma (e.g. bronchiectasis, cyanotic congenital heart disease or cardiac failure, neuromuscular disorders, immunodeficiency) that could potentially influence the current illness

Entity relations:
- Has_negation("asthma", "other")
- Subsumes("chronic illness", "bronchiectasis")
- OR("bronchiectasis", "neuromuscular disorders", "cardiac failure", "cyanotic congenital heart disease", "immunodeficiency")